Clinical trial exclusion criterion:
any other factors which would interfere with pain assessment and management

Annotated entities:
- Condition: "interfere"
- Procedure: "pain assessment"
- Procedure: "management"
- Condition: "other factors"